下列細菌，何者最少造成菌血症？
A. 大腸桿菌（Escherichia coli）
B. 霍亂弧菌（Vibrio cholerae）
C. 綠膿桿菌（Pseudomonas aeruginosa）
D. 傷寒沙門氏菌（Salmonella typhi）

正確答案：B. 霍亂弧菌（Vibrio cholerae）